Clinical trial exclusion criterion:
Endometriosis III-IV stage or adenomyosis

Entity relations:
- AND("III-IV stage", "Endometriosis")
- OR("Endometriosis", "adenomyosis")